Clinical trial inclusion criteria:
Healthy adults 30- 65 years old,
BMI 25-35 kg/m2,
nondiabetic as defined by fasting plasma glucose <126 mg/dL
Lipids: one group with an LDL =/>130 and Triglycerides < 150 mg/dL The 2nd group will have and LDL=/>130 mg/dL and Triglycerides =/>150 mg/dL but less than 400 mg/dL.

Annotated entities:
- Condition: "Healthy"
- Person: "adults"
- Value: "30- 65 years old"
- Person: "old"
- Measurement: "BMI"
- Value: "25-35 kg/m2"
- Condition: "nondiabetic"
- Measurement: "fasting plasma glucose"
- Value: "<126 mg/dL"
- Measurement: "LDL"
- Value: "=/>130"
- Measurement: "Triglycerides"
- Value: "< 150 mg/dL"
- Non-representable: "The 2nd group will have and LDL=/>130 mg/dL and Triglycerides =/>150 mg/dL but less than 400 mg/dL."
- Non-representable: "one group with"